Clinical trial inclusion criterion:
Absence of significant scarring in the pelvis from previous surgeries.

Entity relations:
- Has_temporal("surgeries", "previous")
- multi("from previous surgeries", "surgeries")
- Has_qualifier("significant scarring", "pelvis")
- Has_qualifier("significant scarring", "from previous surgeries")
- Has_negation("significant scarring", "Absence")